Patients with cardiogenic shock - Killip Class 4

The above is a clinical trial exclusion criterion. Annotated with entity spans:
Patients with [Condition: cardiogenic shock] - [Measurement: Killip Class] [Value: 4]